Clinical trial inclusion criterion:
Patients must be registered in a social security system or with a health insurance coverage

Entity relations:
- multi("registered in a social security system", "registered in a social security system")
- multi("health insurance coverage", "health insurance coverage")